下列關於腰椎椎間盤突出（HIVD）的敘述，何者正確？
A. 發生位置多在椎間盤的後外側（posterolateral）
B. 最常見的發生部位為腰椎第1-2節（L1-2）的椎間盤
C. 位於腰椎第4-5節（L4-5）發生的 HIVD 通常會壓迫L4的神經根（nerve root）
D. 所有的HIVD都一定需要手術處理

正確答案：A. 發生位置多在椎間盤的後外側（posterolateral）